Which gene is mutated in the Karak syndrome?

PLA2G6 gene is mutated in the Karak syndrome.